Ulcer located on the legs or feet, stage III or IV (Wagner Classification System)

The above is a clinical trial inclusion criterion. Annotated with entity spans:
[Condition: Ulcer] located on the [Qualifier: legs] or [Qualifier: feet], [Measurement: stage] [Value: III or IV] ([Qualifier: Wagner Classification System])